若孕婦羊水過少（oligohydramnios），則胎兒最有可能伴隨下列何缺陷？
A. 無腦畸形（anencephaly）
B. 食道閉鎖（esophageal atresia）
C. 缺少臍動脈（umbilical artery）
D. 腎臟未發育（renal agenesis）

正確答案：D. 腎臟未發育（renal agenesis）